Clinical trial exclusion criterion:
Hepatic or renal functions abnormal (alanine aminotransferase or aspartate transaminase or total bilirubin > 1.5 upper limit of normal [ULN], or serum creatinine or blood urea nitrogen > 1.5 ULN);

Annotated entities:
- Measurement: "Hepatic functions"
- Measurement: "renal functions"
- Value: "abnormal"
- Measurement: "alanine aminotransferase"
- Measurement: "aspartate transaminase"
- Measurement: "total bilirubin"
- Value: "> 1.5 upper limit of normal [ULN]"
- Measurement: "serum creatinine"
- Measurement: "blood urea nitrogen"
- Value: "> 1.5 ULN"